下列有關子宮肌瘤的處置，何者錯誤？
A. 僅有少數可以觀察追蹤
B. 症狀治療：例如止痛藥、鐵劑
C. 手術治療含子宮切除或子宮肌瘤摘除
D. 藥物治療：例如 gonadotrophin-releasing hormone agonist（GnRHa）

正確答案：A. 僅有少數可以觀察追蹤